Currently smokes tobacco (cigarettes)

The above is a clinical trial exclusion criterion. Annotated with entity spans:
Currently [Observation: smokes tobacco] (cigarettes)